Age between one year and 18 years

The above is a clinical trial inclusion criterion. Annotated with entity spans:
[Person: Age] [Value: between one year and 18 years]